Clinical trial inclusion criterion:
ADHD

Annotated entities:
- Condition: "ADHD"